On the transplant waiting list followed by the University of Maryland's nephrology clinic or the Baltimore VA's nephrology clinic

The above is a clinical trial inclusion criterion. Annotated with entity spans:
[Non-query-able: On the transplant waiting list followed by the University of Maryland's nephrology clinic or the Baltimore VA's nephrology clinic]